Clinical trial exclusion criterion:
Contraindication to beta-blocker

Entity relations:
- AND("Contraindication", "beta-blocker")